Amantadine 及 Rimantadine 藥物常被用來治療流行性感冒病毒 A 型，其抑制病毒入侵之機轉為何？
A. 阻止病毒之入侵及解體（uncoating）
B. 阻止病毒在宿主內合成 DNA
C. 阻止病毒在宿主內合成 RNA
D. 阻止病毒在宿主內合成蛋白質

正確答案：A. 阻止病毒之入侵及解體（uncoating）